角膜的痛覺由下列何者傳導？
A. 滑車上神經（supratrochlear nerve）
B. 眶下神經（infraorbital nerve）
C. 鼻睫神經（nasociliary nerve）
D. 視神經（optic nerve）

正確答案：C. 鼻睫神經（nasociliary nerve）